恐慌症在藥物治療有效的情況下，需治療多久？
A. 發作時接受治療
B. 持續 3~5 週
C. 持續 3~5 個月
D. 持續 8~12 個月

正確答案：D. 持續 8~12 個月